Which diseases are associated with the Yaa gene?

Yaa is a Y-chromosome-linked gene that accelerates autoimmune diseases in some autoimmune-prone strains of mice The role of the Yaa gene in lupus syndrome The Y chromosome-linked "autoimmune accelerating" yaa gene suppresses collagen-induced arthritis